Clinical trial inclusion criterion:
Have either newly diagnosed metastatic hormone sensitive prostate cancer (mHSPC) or castration-resistant metastatic prostate cancer (mCRPC) and eligible to undergo treatment with abiraterone acetate (mHSPC or mCRPC) or enzalutamide (mCRPC)

Entity relations:
- Has_qualifier("prostate cancer", "hormone sensitive")
- Has_qualifier("prostate cancer", "metastatic")
- Subsumes("mHSPC", "prostate cancer")
- Has_qualifier("prostate cancer", "metastatic")
- Has_qualifier("prostate cancer", "castration-resistant")
- Subsumes("mCRPC", "prostate cancer")
- AND("treatment", "abiraterone acetate")
- AND("treatment", "mHSPC")
- OR("mHSPC", "mCRPC")
- OR("abiraterone acetate", "enzalutamide")
- OR("prostate cancer", "mCRPC")
- OR("mHSPC", "enzalutamide")